2. Subject has a severe medical or psychiatric illness that, in the opinion of the Investigator, would affect subject safety or compliance

The above is a clinical trial exclusion criterion. Annotated with entity spans:
2. Subject has a [Qualifier: severe] [Condition: medical] or [Condition: psychiatric illness] that, [Qualifier: in the opinion of the Investigator, would affect subject safety or compliance]